Which is the major clinical feature observed in FDXR-associated disease?

Retinal dystrophy is a major clinical feature observed in FDXR-associated disease.